¿Qué tipo de aprendizaje se manifiesta sin que exista un refuerzo obvio?
1. Aprendizaje latente.
2. Aprendizaje vicario.
3. Aprendizaje por insight.
4. Aprendizaje instrumental.
5. Ninguno.

Respuesta correcta: 1. Aprendizaje latente.